Methotrexate 可以當作化療之生化機轉為何？
A. 作為 pyridoxal phosphate 的相似物，抑制酵素活性
B. 抑制 dihydrofolate reductase
C. 競爭性抑制 EPSP synthase
D. 直接抑制糖解作用（glycolysis）

正確答案：B. 抑制 dihydrofolate reductase